抗體與抗原之結合不依賴：
A. 共價鍵（covalent bonds）
B. 靜電作用（electrostatic interactions）
C. 氫鍵（hydrogen bonds）
D. 凡德瓦爾力（van der Waals forces）

正確答案：A. 共價鍵（covalent bonds）